Liver disease,

The above is a clinical trial exclusion criterion. Annotated with entity spans:
[Condition: Liver disease],